70 歲婦人因發燒與疑似腹膜炎被收住院。住院時血液生化檢查：albumin 3.2 g/dL, GPT 80 U/L, BUN  mg/dL, creatinine 1.2 mg/dL, amylase 280 U/L, glucose 125 mg/dL。給予抗生素 Cefazolin 1 g q8h 和 Gentamicin 80 mg q12h 注射，禁食並予靜脈營養。三天後體溫下降至 37℃，脈搏、血壓正常，此時體重為 45 公斤。一週後開始給予軟性食物。第十天測得 BUN 和 creatinine 各為 40 和 3.5 mg/dL，血清電解質（mmol/L）：Na 134, K 3.3, Cl 95；病人一日尿量測得為 2,000 mL，尿液分析正常。下列有關此病人的處置何者最為恰當？
A. 給予白蛋白靜脈注射，補充營養並增加腎臟血液灌流
B. 給予 0.9% NaCl 1,000 mL，並給予靜脈注射 Furosemide 40 mg
C. 給予 Dopamine，5 μg/kg/min，並補充鉀離子
D. 重新評估抗生素使用的必要性

正確答案：D. 重新評估抗生素使用的必要性